Clinical trial inclusion criterion:
Patients with end-stage renal disease(ESRD)/chronic kidney disease(CKD)stage 5

Entity relations:
- Subsumes("end-stage renal disease", "ESRD")
- Subsumes("chronic kidney disease", "CKD")
- Has_qualifier("chronic kidney disease", "stage 5")
- Subsumes("end-stage renal disease", "chronic kidney disease")